Clinical trial exclusion criterion:
Foreshortened life-expectancy or severe comorbidities precluding study follow-up period

Annotated entities:
- Observation: "life-expectancy"
- Value: "Foreshortened"
- Condition: "severe comorbidities"